Clinical trial exclusion criterion:
1. Justification: individuals with noise-induced hearing problems may be particularly vulnerable to the acoustic noise generated by TMS and MRI equipment.

Annotated entities:
- Parsing_Error: "1."
- Non-representable: "Justification: individuals with noise-induced hearing problems may be particularly vulnerable to the acoustic noise generated by TMS and MRI equipment."